Presence of intracranial aneurysm (with or without rupture)

The above is a clinical trial inclusion criterion. Annotated with entity spans:
Presence of [Condition: intracranial aneurysm] ([Qualifier: with] or [Qualifier: without rupture])